Which variables are included in the ALT-70 Score for cellulitis?

ALT-70 cellulitis score includes: Asymmetry (3 points), Leukocytosis (1 point), Tachycardia (1 point), and age ≥70 (2 points).